Clinical trial exclusion criterion:
Has undergone corneal refractive surgery.

Annotated entities:
- Procedure: "corneal refractive surgery"